Clinical trial exclusion criterion:
pre-operatory hypoalbuminemy

Entity relations:
- Has_qualifier("hypoalbuminemy", "pre-operatory")